Established (i.e. by clinical signs or imaging studies) coronary artery disease (CAD) Established (i.e. by clinical signs or imaging studies) peripheral vascular disease (PVD) Previous stroke Previous MI Diabetes mellitus with target organ disease OR

The above is a clinical trial inclusion criterion. Annotated with entity spans:
[Observation: Established] (i.e. by [Observation: clinical signs] or [Procedure: imaging studies]) [Condition: coronary artery disease (CAD)] [Observation: Established] (i.e. by [Observation: clinical signs] or [Procedure: imaging studies]) [Condition: peripheral vascular disease (PVD)] [Temporal: Previous] [Condition: stroke] [Temporal: Previous] [Condition: MI] [Condition: Diabetes mellitus] with [Condition: target organ disease] [Parsing_Error: OR]